下列何者是精神分裂症之不良預後因子？
A. 急性發作
B. 已婚
C. 明顯的負性症狀
D. 家族史有躁鬱症

正確答案：C. 明顯的負性症狀